Clinical trial exclusion criterion:
History of allergic or hypersensitivity to tandospirone

Annotated entities:
- Condition: "hypersensitivity"
- Drug: "tandospirone"
- Condition: "allergic"
- Qualifier: "tandospirone"